Clinical trial exclusion criterion:
History of clinically significant hypersensitivity or allergic drug reactions

Annotated entities:
- Qualifier: "clinically significant"
- Subjective_judgement: "clinically significant"
- Condition: "hypersensitivity"
- Condition: "allergic drug reactions"